El oncogén C-MYC codifica un:
1. Factor de crecimiento.
2. Factor de transcripción.
3. Receptor de factor de crecimiento.
4. Regulador de ciclo celular.

Respuesta correcta: 2. Factor de transcripción.